空氣污染指標（Pollutant standard index, PSI）在多少以上，會對身體不好且較敏感的人，使其健康症狀更加惡化？
A. 50
B. 100
C. 150
D. 200

正確答案：B. 100